主動脈瓣狹窄的病人，其左心室與升主動脈心縮期壓力差在 50 mmHg，同時有下列何種症狀時，要考慮主動脈瓣置換手術？
A. 腦部栓塞症
B. 心電圖有左心室肥大的現象
C. 心絞痛
D. 心室過早收縮

正確答案：C. 心絞痛